滿周歲的幼兒不適合接種下列何種疫苗？
A. 水痘疫苗
B. A型肝炎疫苗
C. 輪狀病毒疫苗
D. 肺炎鏈球菌疫苗

正確答案：C. 輪狀病毒疫苗